下列何者 適合利用聚合酶鏈鎖反應（polymerase chain reaction）法分析基因長度的變化以作診斷？
A. 柯林菲特氏症候群（Klinefelter syndrome）
B. X 染色體脆折症候群（fragile-X syndrome）
C. 馬凡氏症候群（Marfan syndrome）
D. 龐貝氏症（Pompe disease）

正確答案：B. X 染色體脆折症候群（fragile-X syndrome）